Clinical trial exclusion criterion:
indication for catheter insertion;

Annotated entities:
- Procedure: "catheter insertion"
- Mood: "indication"